Clinical trial exclusion criterion:
Pregnancy or lactation.

Entity relations:
- OR("Pregnancy", "lactation")